Clinical trial exclusion criterion:
3. Expected poor compliance with the study protocol.

Annotated entities:
- Parsing_Error: "3."
- Non-query-able: "Expected poor compliance with the study protocol."